¿Cuál es la fuente de los conflictos entre grupos según la Teoría del Conflicto de Grupo Realista?:
1. La atracción hacia el poder.
2. Los prejuicios intergrupales.
3. Las diferencias interpersonales.
4. La competencia por recursos limitados.

Respuesta correcta: 4. La competencia por recursos limitados.